Clinical trial exclusion criterion:
previous intubation or apnea history

Annotated entities:
- Procedure: "intubation"
- Condition: "apnea"
- Temporal: "history"
- Temporal: "previous"